with written parental consent

The above is a clinical trial inclusion criterion. Annotated with entity spans:
[Informed_consent: with written parental consent]